Clinical trial inclusion criterion:
Total bilirubin < 1.5 x upper limit of normal

Annotated entities:
- Measurement: "Total bilirubin"
- Value: "< 1.5 x upper limit of normal"